¿Cuál de los siguientes tipos de orbitales es más penetrante para igual número cuántico principal?
1. p.
2. d.
3. s.
4. f.

Respuesta correcta: 3. s.